Clinical trial inclusion criterion:
Documented liver biopsy result consistent with PBC

Annotated entities:
- Procedure: "liver biopsy"
- Condition: "PBC"